蘇先生 40 歲，為電腦程式設計師，兩年多來雙手操作日益笨拙，大拇指、食指、中指、及無名指的一半感覺麻木，右手魚際肌群（thenar muscles）有萎縮的現象，上臂及前臂無異狀。您在為蘇先生進行身體檢查時，最可能發現下列何者？
A. 法侖氏測驗（Phalen's test）陰性反應
B. 中指靜態二點鑑別（two points discrimination）小於 3 mm
C. 扣診手腕腹側，蘇先生表示有如被電到的酸麻感（Tinel's sign 陽性反應）
D. 屈拇指長肌（flexor pollicis longus）麻痺

正確答案：C. 扣診手腕腹側，蘇先生表示有如被電到的酸麻感（Tinel's sign 陽性反應）